La característica que la mayoría de los trastornos de síntomas somáticos comparten es:
1. Uno de los síntomas de alteración de la función motora y preocupación por la salud.
2. La excesiva preocupación por padecer o contraer una enfermedad grave que origine inmovilidad.
3. El pensamiento excesivo y persistente sobre la gravedad de los síntomas.
4. La importancia de los síntomas somáticos asociados con malestar y deterioro significativo.

Respuesta correcta: 4. La importancia de los síntomas somáticos asociados con malestar y deterioro significativo.